Presence of coagulation disorders

The above is a clinical trial exclusion criterion. Annotated with entity spans:
Presence of [Condition: coagulation disorders]